一位 4 歲小妹妹晚上遭父親打傷後昏迷，被救護車送到醫院後，立即氣管插管，瞳孔檢查左 4 mm，右 7 mm，無光反射，手腳對疼痛有反應，昏迷指數為幾分？
A. 3
B. 5
C. 7
D. 9

正確答案：C. 7